Clinical trial exclusion criteria:
indication for catheter insertion;
contraindications to brachial plexus block (e.g., allergy to local anaesthetics, malignancy or infection in the area);
existing neurological deficit in the area to be blocked;
pregnancy;
history of neck surgery or radiotherapy;
severe respiratory disease;
chest deformity;
inability to understand the informed consent and demands of the study;
patient refusal.

Annotated entities:
- Procedure: "catheter insertion"
- Mood: "indication"
- Condition: "contraindications"
- Procedure: "brachial plexus block"
- Condition: "allergy"
- Drug: "local anaesthetics"
- Condition: "malignancy"
- Condition: "infection"
- Qualifier: "in the area"
- Condition: "neurological deficit"
- Temporal: "existing"
- Qualifier: "area to be blocked"
- Condition: "pregnancy"
- Temporal: "history"
- Procedure: "neck surgery"
- Procedure: "radiotherapy"
- Qualifier: "severe"
- Condition: "respiratory disease"
- Condition: "chest deformity"
- Informed_consent: "inability to understand the informed consent and demands of the study;"
- Informed_consent: "patient refusal"